Paciente de 68 años que consulta por edemas y astenia. En la analítica realizada se constata creatinina de 5 mg/dl, hemoglobina de 10 gr/dl y una marcada hipogammaglobulinemia en suero a expensas de IgG, IgA e IgM. Un análisis de orina revela la presencia de cadenas ligeras kappa. ¿Cuál es su sospecha diagnóstica?
1. Enfermedad por depósito de cadenas ligeras kappa.
2. Síndrome nefrótico.
3. Amiloidosis.
4. Mieloma IgA con preoteinuria Bence Jones.
5. Mieloma de cadenas ligeras.

Respuesta correcta: 5. Mieloma de cadenas ligeras.